En espectroscopía de absorción atómica, la atomización electrotérmica tiene algunas ventajas respecto a atomización con llama, como es:
1. Mayor reproducibilidad.
2. Sensibilidad elevada.
3. Baja señal de fondo.
4. Elevado intervalo analítico.

Respuesta correcta: 2. Sensibilidad elevada.